下列關於疝氣之敘述，何者錯誤？
A. 股疝氣（femoral hernia）及間接型腹股溝疝氣（indirect type inguinal hernia）都以右側為主
B. 股疝氣最易造成腸子壞死（20%），故應在初次診斷時就接受手術治療
C. 切口疝氣（incisional hernia）都可以直接縫合（primary closure），即使疝氣洞口大於5公分也不需要使用人工網膜
D. 肥胖及腹部手術術後傷口感染都能造成切口疝氣（incisional hernia）的發生率增加

正確答案：C. 切口疝氣（incisional hernia）都可以直接縫合（primary closure），即使疝氣洞口大於5公分也不需要使用人工網膜